Clinical trial exclusion criterion:
administration of a vaccine during the period starting one month before the dose of vaccine and ending one month after

Entity relations:
- Has_index("during the period starting one month before the dose of vaccine and ending one month after", "the dose of vaccine")
- multi("the dose of vaccine", "vaccine")